若甲乙兩地各年齡層年齡別死亡率完全相同，下列敘述何者最正確？
A. 甲乙兩地之粗死亡率必定相同
B. 甲乙兩地之年齡標準化死亡率必定相同
C. 甲地人口比乙地老化，則甲地之粗死亡率必小於乙地
D. 甲乙兩地間年齡標準化死亡率之差異，不會隨標準人口年齡組成不同而有變異

正確答案：B. 甲乙兩地之年齡標準化死亡率必定相同